Clinical trial inclusion criterion:
VAS leg pain of at least 40/100 at baseline.

Annotated entities:
- Measurement: "VAS leg pain"
- Value: "at least 40/100"
- Temporal: "at baseline"